Lipid-rich plaque on NIRS(Intracoronary Near-Infrared Spectroscopy) (defined as maxLCBI4mm>315)

The above is a clinical trial inclusion criterion. Annotated with entity spans:
[Condition: Lipid-rich plaque] on [Procedure: NIRS]([Procedure: Intracoronary Near-Infrared Spectroscopy]) (defined as [Measurement: maxLCBI4mm][Value: >315])